Clinical trial exclusion criterion:
Presence of cognitive disabilities

Annotated entities:
- Condition: "cognitive disabilities"